Clinical trial exclusion criterion:
A significant history of drug/solvent abuse within 5 years of screening or a positive test for drugs of abuse test at screening or on Day -1.

Annotated entities:
- Condition: "drug/solvent abuse"
- Temporal: "history"
- Temporal: "within 5 years of screening"
- Reference_point: "screening"
- Measurement: "drugs of abuse test"
- Value: "positive"
- Temporal: "at screening"
- Reference_point: "screening"